Clinical trial exclusion criterion:
Bypass graft lesion

Annotated entities:
- Device: "Bypass graft"
- Condition: "lesion"